Cuando        realizamos      el   triple     test (alfafetoproteina,    gonadotropina     coriónica humana y el estriol no conjugado) a las embarazadas, la sensibilidad y especificidad frente a la trisomía 21 (S. de Down) son del 63 y 95% respectivamente. Ello significa:
1. El porcentaje de falsos negativos es del 5%.
2. El porcentaje de falsos positivos es del 37%.
3. El Área Bajo la Curva (AUC) ROC valdría 1.
4. La probabilidad de no tener trisomía 21 (S. de Down) siendo el resultado negativo es del 95%.
5. La probabilidad de tener resultado positivo a la prueba teniendo la trisomía 21 (S. de Down) es del 63%.

Respuesta correcta: 5. La probabilidad de tener resultado positivo a la prueba teniendo la trisomía 21 (S. de Down) es del 63%.